Clinical trial inclusion criterion:
Substance Use Disorder is diagnosed according to DSM-5 criteria.

Entity relations:
- Has_qualifier("Substance Use Disorder", "DSM-5")